En el estudio de las proteínas. ¿Cuál es el propósito del tratamiento con β-mercaptoetanol?:
1. Hidrolizar la proteína.
2. Romper los puentes disulfuro.
3. Añadir cargas positivas.
4. Añadir cargas negativas.
5. General un derivado de aminoácidos en la degradación de Edman.

Respuesta correcta: 2. Romper los puentes disulfuro.